Clinical trial inclusion criterion:
18-45 years

Entity relations:
- Has_value("years", "18-45")